Clinical trial exclusion criterion:
1. Clinically significant deviation from the Guide for Clinically Relevant Abnormalities (see Part II ADMINISTRATIVE ASPECTS OF BIOEQUIVALENCE PROTOCOLS).

Annotated entities:
- Parsing_Error: "1."
- Subjective_judgement: "Clinically significant"
- Context_Error: "Guide for Clinically Relevant Abnormalities"
- Non-query-able: "Clinically significant deviation from the Guide for Clinically Relevant Abnormalities (see Part II ADMINISTRATIVE ASPECTS OF BIOEQUIVALENCE PROTOCOLS)"